Which R/Bioconductor package has been developed for the analysis of psychiatric disease genes?

psygenet2r